Clinical trial exclusion criterion:
Type II diabetes mellitus;

Annotated entities:
- Condition: "Type II diabetes mellitus"